Clinical trial exclusion criterion:
Untreated pituitary insufficiency.

Entity relations:
- Has_qualifier("pituitary insufficiency", "Untreated")